下列那一項疾病是由遲發性過敏反應（delayed-type hypersensitivity）所引起？
A. 異位性皮膚炎（atopic dermatitis）
B. 接觸性過敏反應（contact hypersensitivity）
C. 季節性鼻炎（perennial rhinitis）
D. 輸血反應（transfusion reaction）

正確答案：B. 接觸性過敏反應（contact hypersensitivity）